Clinical trial exclusion criterion:
Hypersensibility to toxin or excipients

Annotated entities:
- Condition: "Hypersensibility"
- Drug: "toxin"
- Drug: "excipients"